下列何者是華生與克理克（Watson-Crick）DNA結構模型的正確描述？
A. 磷酸基團（phosphate groups）位於雙股螺旋的內部
B. DNA雙股螺旋中兩股平行（parallel）且方向（5'→3'）相同
C. DNA雙股螺旋中兩股間的距離足夠容納兩個嘌呤（purines）或兩個嘧啶（pyrimidines）
D. 同股內相鄰兩個核苷酸鹼基的距離為3.4 Å

正確答案：D. 同股內相鄰兩個核苷酸鹼基的距離為3.4 Å